El término “Psicodiagnóstico” fue acuñado por:
1. Rorschach y proviene de la tradición semántica médica.
2. Cattell y proviene de la tradición semántica psicológica.
3. Cronbach y proviene de la tradición semántica estadística.
4. Rogers y proviene de la tradición semántica de la filosofía.

Respuesta correcta: 1. Rorschach y proviene de la tradición semántica médica.